Unstable cardiac disease despite treatment, myocardial infarction within 6 months prior to study entry

The above is a clinical trial exclusion criterion. Annotated with entity spans:
[Condition: Unstable cardiac disease] despite [Procedure: treatment], [Condition: myocardial infarction] [Temporal: within 6 months prior to study entry]